Clinical trial inclusion criterion:
patient 18 years old and more

Entity relations:
- Has_value("old", "and more 18 years")